小娟是位 14 歲國中學生，因為這個學期學業明顯退步、變得沈默寡言、體重增加及腹部日漸隆起，被母親發現有異常而帶來門診。醫師在開始看診時，需如何處理最為適合？
A. 必須馬上作身體診查，甚至骨盆腔檢查探索病因
B. 少女常因害羞不願配合檢查，因此可以未徵得少女同意，先作尿液檢查是否懷孕
C. 僅針對母親的疑慮作臨床檢查
D. 徵得母親及小娟同意，用部分時間與小娟單獨會談

正確答案：D. 徵得母親及小娟同意，用部分時間與小娟單獨會談